Clinical trial inclusion criterion:
laparoscopic roux-en-y gastric bypass

Annotated entities:
- Procedure: "roux-en-y gastric bypass"
- Qualifier: "laparoscopic"